M3 (= 25%) marrow on day 15 OR meets SR criteria but M3 marrow on day 15 and *M1 marrow on day 33.

The above is a clinical trial inclusion criterion. Annotated with entity spans:
[Line: M3 (= 25%) marrow on day 15 OR meets SR criteria but M3 marrow on day 15 and *M1 marrow on day 33].